Clinical trial exclusion criterion:
History or presence of any clinically significant disease or disorder

Entity relations:
- Has_qualifier("clinically significant disorder", "clinically significant")
- Has_qualifier("clinically significant disease", "clinically significant")
- Has_temporal("clinically significant disorder", "History")
- Has_temporal("clinically significant disease", "History")
- OR("clinically significant disease", "clinically significant disorder")